Severe bruxism or clenching habits

The above is a clinical trial exclusion criterion. Annotated with entity spans:
Severe [Observation: bruxism] or [Observation: clenching habits]